Clinical trial inclusion criteria:
elective procedure
weight over 40 kg
American Society of Anesthesiology class I-III
first upper GI endoscopy procedure
finnish or/and swedish speaking

Annotated entities:
- Procedure: "elective procedure"
- Measurement: "weight"
- Value: "over 40 kg"
- Measurement: "American Society of Anesthesiology class"
- Value: "I-III"
- Multiplier: "first"
- Qualifier: "upper GI"
- Procedure: "endoscopy procedure"
- Observation: "finnish speaking"
- Observation: "swedish speaking"